Clinical trial exclusion criteria:
Had/have the following prior/concurrent therapy:
Systemic corticosteroids (oral or injectable) within 7 days of first dose of 852A (topical or inhaled steroids are allowed)
Investigational drugs/agents within 14 days of first dose of 852A
Immunosuppressive therapy, including cytotoxic agents within 14 days of first dose of 852A (nitrosoureas within 30 days of first dose)
Drugs known to induce QT interval prolongation and/or induce Torsades de pointes unless best available drug required to treat life-threatening conditions
Radiotherapy within 3 weeks of the first dose of 852A
Hematopoietic cell transplantation within 4 weeks of first dose of 852A
Evidence of active infection within 3 days of first dose of 852A
Active fungal infection or pulmonary infiltrates (prior treated disease stable for 2 weeks is allowable)
Cardiac ischemia, cardiac arrhythmias or congestive heart failure uncontrolled by medication
History of, or clinical evidence of, a condition which, in the opinion of the investigator, could confound the results of the study or put the subject at undue risk
Uncontrolled intercurrent or chronic illness
Active autoimmune disease requiring immunosuppressive therapy within 30 days
Active coagulation disorder not controlled with medication
Pregnant or lactating
Concurrent malignancy (if in remission, at least 5 years disease free) except for localized (in-situ) disease, basal carcinomas and cutaneous squamous cell carcinomas that have been adequately treated
Any history of brain metastases or any other active central nervous system (CNS) disease

Annotated entities:
- Drug: "Systemic corticosteroids"
- Temporal: "within 7 days of first dose"
- Drug: "852A"
- Drug: "topical steroids"
- Drug: "inhaled steroids"
- Negation: "are allowed"
- Qualifier: "injectable"
- Qualifier: "oral"
- Drug: "Investigational drugs/agents"
- Temporal: "within 14 days of first dose"
- Drug: "852A"
- Procedure: "Immunosuppressive therapy"
- Drug: "cytotoxic agents"
- Temporal: "within 14 days of first dose"
- Drug: "852A"
- Drug: "nitrosoureas"
- Temporal: "within 30 days of first dose"
- Drug: "Drugs known to induce QT interval prolongation"
- Drug: "Drugs known to induce Torsades de pointes"
- Non-representable: "unless best available drug required to treat life-threatening conditions"
- Procedure: "Radiotherapy"
- Temporal: "within 3 weeks of the first dose"
- Drug: "852A"
- Procedure: "Hematopoietic cell transplantation"
- Temporal: "within 4 weeks of first dose"
- Drug: "852A"
- Condition: "active infection"
- Observation: "Evidence"
- Temporal: "within 3 days of first dose"
- Drug: "852A"
- Condition: "fungal infection"
- Condition: "pulmonary infiltrates"
- Condition: "prior treated disease"
- Qualifier: "stable"
- Temporal: "for 2 weeks"
- Negation: "is allowable"
- Condition: "Cardiac ischemia"
- Condition: "cardiac arrhythmias"
- Condition: "congestive heart failure"
- Qualifier: "uncontrolled by medication"
- Temporal: "History"
- Observation: "clinical evidence"
- Condition: "could confound the results of the study or put the subject at undue risk a condition which"
- Condition: "intercurrent illness"
- Condition: "chronic illness"
- Qualifier: "Uncontrolled"
- Condition: "autoimmune disease"
- Qualifier: "requiring"
- Procedure: "immunosuppressive therapy"
- Temporal: "within 30 days"
- Temporal: "Active"
- Condition: "coagulation disorder"
- Temporal: "Active"
- Qualifier: "controlled with medication"
- Negation: "not"
- Condition: "Pregnant"
- Condition: "lactating"
- Condition: "malignancy"
- Temporal: "Concurrent"
- Value: "at least 5 years"
- Qualifier: "disease free"
- Qualifier: "in remission"
- Condition: "localized (in-situ) disease"
- Condition: "basal carcinomas"
- Condition: "cutaneous squamous cell carcinomas"
- Qualifier: "adequately treated"
- Negation: "except for"
- Condition: "brain metastases"
- Temporal: "history of"
- Condition: "any other central nervous system (CNS) disease"
- Temporal: "active"